Clinical trial exclusion criterion:
Allergy to ropivacaine, bupivacaine, or other local anesthetic agents

Entity relations:
- AND("Allergy", "ropivacaine")
- OR("ropivacaine", "bupivacaine", "local anesthetic agents")